Clinical trial inclusion criterion:
male and female patients over the age of 18 years.

Entity relations:
- Has_value("age", "over 18 years")
- OR("male", "female")